Heterozygous cohorts: Use of prescription medications on a regular basis is not allowed with the following exceptions:

The above is a clinical trial exclusion criterion. Annotated with entity spans:
[Grammar_Error: Heterozygous cohorts: Use of prescription medications on a regular basis is not allowed with the following exceptions:]